巴西副球黴菌（Paracoccidioides brasiliensis） 酵母細胞之細胞壁中，下列那一種組成的含量和致病力最有關？
A. 1,3-α-葡聚醣（1,3-α-glucan）
B. 1,3-β-葡聚醣（1,3-β-glucan）
C. 半乳甘露聚醣（Galactomannan）
D. 幾丁質（Chitin）

正確答案：A. 1,3-α-葡聚醣（1,3-α-glucan）